Clinical trial inclusion criterion:
English speaking ability.

Annotated entities:
- Observation: "English speaking ability"